家庭醫師欲規劃社區登革熱介入措施，依社區導向基層醫療（community-oriented primary care）循環的順序，下列何者正確？
A. 確認問題→確認群體→策略規劃→介入實施→評估成效
B. 確認群體→確認問題→策略規劃→介入實施→評估成效
C. 確認問題→確認群體→介入實施→策略規劃→評估成效
D. 確認群體→確認問題→介入實施→策略規劃→評估成效

正確答案：B. 確認群體→確認問題→策略規劃→介入實施→評估成效